What is the function of the enzymes known as dual specificity phoshpatases (DUSPs)?

Dual-specificity protein phosphatases participate in signal transduction pathways inactivating mitogen-activated protein kinases (MAP kinases). 
Dual-specificity phosphatases (DUSPs) dephosphorylate phosphotyrosine and phosphoserine/phosphothreonine residues on target MAPKs. 
These signaling pathways are of critical importance in the regulation of numerous biological processes, including cell proliferation, differentiation and development.